do not use tamoxifen or aromatase inhibitor

The above is a clinical trial exclusion criterion. Annotated with entity spans:
do [Negation: not] use [Drug: tamoxifen] or [Drug: aromatase inhibitor]